Pneumonectomy

The above is a clinical trial exclusion criterion. Annotated with entity spans:
[Procedure: Pneumonectomy]